Clinical trial exclusion criterion:
Hypoalbuminemia defined as serum albumin <2.0g/dL

Entity relations:
- Has_value("serum albumin", "<2.0g/dL")
- Subsumes("Hypoalbuminemia", "serum albumin")